Clinical trial exclusion criteria:
Preoperative renal failure requiring dialysis
Poorly controlled pulmonary disease (severe asthma or COPD) -Contraindication to regional anesthesia (recent anticoagulant use)
Sleep apnea or morbid obesity with possible sleep apnea
Allergy to methadone
Significant preoperative pain requiring treatment with high doses of opioids (more than 6-8 Norco tablets or equivalence per day) or recent history of opioid abuse

Annotated entities:
- Temporal: "Preoperative"
- Condition: "renal failure"
- Mood: "requiring"
- Procedure: "dialysis"
- Qualifier: "Poorly controlled"
- Condition: "pulmonary disease"
- Qualifier: "severe"
- Condition: "asthma"
- Condition: "COPD"
- Condition: "Contraindication"
- Procedure: "regional anesthesia"
- Temporal: "recent"
- Drug: "anticoagulant"
- Condition: "Sleep apnea"
- Condition: "morbid obesity"
- Mood: "possible"
- Condition: "sleep apnea"
- Condition: "Allergy"
- Drug: "methadone"
- Condition: "preoperative pain"
- Qualifier: "Significant"
- Mood: "requiring"
- Multiplier: "high doses"
- Drug: "opioids"
- Multiplier: "more than 6-8 per day"
- Drug: "Norco tablets"
- Drug: "equivalence"
- Temporal: "recent"
- Temporal: "history"
- Condition: "opioid abuse"